Clinical trial exclusion criterion:
Planned continued antenatal care/ delivery at centre not included in trial

Annotated entities:
- Competing_trial: "Planned continued antenatal care/ delivery at centre not included in trial"